Clinical trial inclusion criterion:
Male and/or female patients from 30-80 years of age with a diagnosis of Type 2 diabetes (WHO criteria).

Annotated entities:
- Value: "30-80 years"
- Condition: "Type 2 diabetes"
- Person: "of age"